Clinical trial inclusion criterion:
Negative result on ßhuman chorionic gonadotropin pregnancy test (if applicable)

Annotated entities:
- Value: "Negative"
- Measurement: "ßhuman chorionic gonadotropin pregnancy test"
- Non-representable: "if applicable"